What is the effect of rHDL-apoE3 on vascular permeability?

rHDL-apoE3 markedly improves vascular permeability as demonstrated by the reduced concentration of Evans Blue dye in tissues such as the stomach, the tongue and the urinary bladder and ameliorated hypercholesterolemia.